Clinical trial exclusion criterion:
Cardiac arrest

Annotated entities:
- Condition: "Cardiac arrest"